El infrarrojo cercano es la zona del espectro electromagnético comprendida entre:
1. 100-250 nm.
2. 200-450 nm.
3. 600-750 nm.
4. 800-2500 nm.
5. 3000-8000 nm.

Respuesta correcta: 4. 800-2500 nm.